Clinical trial inclusion criterion:
Diagnostic or therapeutic procedures

Entity relations:
- OR("Diagnostic procedures", "therapeutic procedures")